一位65歲女性病人，有肥胖、腦中風、高血壓的病史。4週前曾因大腿骨折而接受手術治療，目前在家臥床 休養，傷口癒合良好。此病人清晨突然覺得噁心、胸悶，喘不過氣來，家人緊急送醫治療。到院時體溫正常意識清楚，呼吸27次/min，心跳120次/min，血壓88/43 mmHg，血氧飽和度86%。你發現心電圖在Lead V1 至V4出現新的T wave inversion及S1-Q3-T3 pattern，該病人最可能之診斷為何？
A. 主動脈剝離（aortic dissection）
B. 急性腦中風（acute stroke）
C. 肺栓塞（pulmonary embolism）
D. 大葉性肺炎（lobar pneumonia）

正確答案：C. 肺栓塞（pulmonary embolism）